What is MRSA?

(MRSA, methicillin-resistant S. aureus)